一位 4 歲男童最近隨母親回大陸省親，回國後他與母親均發生腹瀉及發燒現象，經醫師診斷為急性腸胃炎。過去兩天母親注意到男童變得蒼白、疲倦，而且雙眼浮腫、尿液明顯變少。抽血檢驗發現男童之血色素及血小板數皆降低，尿液常規檢查可見到血尿、蛋白尿。下列何者為最可能之診斷？
A. Henoch-Schönlein 紫斑症（Henoch-Schönlein purpura）
B. IgA 腎炎（IgA nephropathy）
C. 鏈球菌感染後之急性腎炎（poststreptococcal glomerulonephritis）
D. 溶血性尿毒症候群（hemolytic-uremic syndrome）

正確答案：D. 溶血性尿毒症候群（hemolytic-uremic syndrome）